Clinical trial exclusion criterion:
myocardial infarction within the preceding 4 weeks

Entity relations:
- Has_temporal("myocardial infarction", "within the preceding 4 weeks")
- Has_index("within the preceding 4 weeks", "the preceding 4 weeks")